低血糖是臨床上常見的現象，下列那一項敘述最不適當？
A. 胰島素瘤（insulinoma）的典型表現為Whipple's triad，是低血糖最常見的原因
B. 低血糖可引起致命的結果，必須及時處理
C. 低血糖的常見症狀包括發慌、心跳加速、冒冷	及昏迷等
D. 臨床上可引起低血糖的藥物包括胰島素、sulfonylureas及glinides類

正確答案：A. 胰島素瘤（insulinoma）的典型表現為Whipple's triad，是低血糖最常見的原因